Clinical trial inclusion criterion:
Positive sputum culture, identification of bacterial type confirmed Mycobacterium tuberculosis. MGIT drug sensitivity test (DST) results are sensitive of the first-line drugs (isoniazid, streptomycin, rifampicin and ethambutol).

Annotated entities:
- Value: "Positive"
- Measurement: "sputum culture"
- Condition: "Mycobacterium tuberculosis"
- Qualifier: "bacterial type"
- Measurement: "MGIT drug sensitivity test (DST)"
- Value: "sensitive of the first-line drugs (isoniazid, streptomycin, rifampicin and ethambutol)"
- Drug: "first-line drugs"
- Drug: "isoniazid"
- Drug: "streptomycin"
- Drug: "rifampicin"
- Drug: "ethambutol"